一位58歲長期在太陽下工作的工人鼻尖出現了一個不會疼痛的硬塊，身體檢查為一個8mm在皮膚表層不會移 動的突起腫塊，表面是發亮蠟狀，並可看到表淺的末梢血管擴張現象，而且腫塊突起處有一小潰瘍，經切片
 證實為皮膚癌，最可能為下列何者？
A. 基底細胞癌（basal cell carcinoma）
B. 狀細胞癌（squamous cell carcinoma）
C. 性黑色素細胞瘤（malignant melanoma）
D. 默克細胞癌（Merkel cell carcinoma）

正確答案：A. 基底細胞癌（basal cell carcinoma）